若此檢查結果為侵襲性鱗狀細胞癌（invasive squamous cell carcinoma），基質侵襲深度為 5 mm，泌尿道攝影（IVP）及膀胱鏡檢查正常。病人詢問可否保留生育能力，則你的回答是：
A. 不可，不管有無淋巴腺或淋巴血管轉移，須接受子宮頸癌根除術
B. 不可，不管有無淋巴腺或淋巴血管轉移，須接受放射線治療
C. 可以，但須無淋巴腺或淋巴血管轉移，可行陰道子宮頸根除術（radical vaginal trachealectomy），保留子宮
D. 可以，但須無淋巴腺或淋巴血管轉移，可行子宮頸圓錐切片，保留子宮

正確答案：C. 可以，但須無淋巴腺或淋巴血管轉移，可行陰道子宮頸根除術（radical vaginal trachealectomy），保留子宮